treatment-naive patients with B-cell lymphoma

The above is a clinical trial inclusion criterion. Annotated with entity spans:
[Condition: treatment]-[Negation: naive] patients with [Condition: B-cell lymphoma]